previous diagnosis of active neoplastic disease

The above is a clinical trial exclusion criterion. Annotated with entity spans:
previous diagnosis of active [Condition: neoplastic disease]